有關頸椎退化性疾病之手術敘述，下列何者錯誤？
A. 頸椎脊髓病變（cervical myelopathy）產生症狀，即需手術治療
B. 急性神經根壓迫，可先保守治療
C. 老年人接受後側椎弓切除術，日後很容易產生脊柱後凸變形
D. 前頸椎手術可能傷到recurrent laryngeal nerve

正確答案：C. 老年人接受後側椎弓切除術，日後很容易產生脊柱後凸變形